Allergy in dexmedethomidine and opioid

The above is a clinical trial exclusion criterion. Annotated with entity spans:
[Condition: Allergy] in [Drug: dexmedethomidine] and [Drug: opioid]